Clinical trial exclusion criterion:
Head trauma

Annotated entities:
- Condition: "Head trauma"